Clinical trial exclusion criterion:
Patients with active infections requiring antibiotics within one month of registration

Annotated entities:
- Condition: "infections"
- Temporal: "active"
- Drug: "antibiotics"
- Temporal: "within one month of registration"